Evidence of gastrointestinal bleeding

The above is a clinical trial exclusion criterion. Annotated with entity spans:
[Observation: Evidence of] [Condition: gastrointestinal bleeding]